Outpatient with primary DSM- IV OCD

The above is a clinical trial inclusion criterion. Annotated with entity spans:
[Visit: Outpatient] with [Qualifier: primary] [Qualifier: DSM- IV] [Condition: OCD]